Clinical trial exclusion criterion:
Bilateral Lower extremity involvement of the suspected infection.

Entity relations:
- Has_qualifier("infection", "Bilateral Lower extremity")